Estimated life expectancy < 1 year from conditions other than TR.

The above is a clinical trial exclusion criterion. Annotated with entity spans:
[Observation: Estimated life expectancy] [Value: < 1 year] from conditions other than TR.